Clinical trial inclusion criterion:
FEV1/SVC <70% of predicted value post bronchodilator (SVC is slow VC) and FEV1 < 80% of predicted value post-bronchodilator

Entity relations:
- Has_value("FEV1/SVC", "<70% of predicted value")
- Has_qualifier("FEV1/SVC", "post bronchodilator")
- Has_temporal("post bronchodilator", "post bronchodilator")
- Has_index("post bronchodilator", "bronchodilator")
- AND("bronchodilator", "bronchodilator")
- AND("bronchodilator", "bronchodilator")
- Has_index("post-bronchodilator", "bronchodilator")
- Has_temporal("post-bronchodilator", "post-bronchodilator")
- Has_value("FEV1", "< 80% of predicted value")
- Has_qualifier("FEV1", "post-bronchodilator")